LA size > 50 mm (parasternal long axis view)

The above is a clinical trial exclusion criterion. Annotated with entity spans:
[Measurement: LA size] [Value: > 50 mm] ([Qualifier: parasternal long axis view])